Clinical trial exclusion criterion:
Acute illness or active systemic infection or sepsis

Annotated entities:
- Condition: "Acute illness"
- Condition: "systemic infection"
- Qualifier: "active"
- Condition: "sepsis"